有關立克次氏體（Rickettsia）之敘述，下列何者錯誤？
A. 其細胞壁含有 peptidoglycan
B. 多經由體蝨、鼠蚤或壁蝨等傳染性昆蟲所傳播
C. 其細胞壁不含 lipopolysaccharide，故沒有內毒素的活性
D. 為絕對細胞內寄生菌

正確答案：C. 其細胞壁不含 lipopolysaccharide，故沒有內毒素的活性